Clinical trial exclusion criterion:
simultaneous both sided extraction or only upper third molar extraction

Annotated entities:
- Temporal: "simultaneous"
- Qualifier: "both sided"
- Procedure: "molar extraction"
- Qualifier: "only upper third"